Which R/bioconductor have been developed for copy number analysis?

CNVRanger, seqCNA, iGC, PLRS, SomatiCA, Copynumber, crlmm, KC-SMARTR are all R/bioconductor packages for copy number analysis